鐙骨肌（stapedius muscle）與下列何肌受相同顱神經支配？
A. 二腹肌後腹（posterior belly of digastric muscle）
B. 翼內肌（medial pterygoid muscle）
C. 上直肌（superior rectus muscle）
D. 莖突咽肌（stylopharyngeal muscle）

正確答案：A. 二腹肌後腹（posterior belly of digastric muscle）